根據多數研究資料結果顯示，老年人的腹主動脈瘤（abdominal aortic aneurysm）最常被誤診為下列何種疾病？
A. 消化性潰瘍（peptic ulcer disease）
B. 腎結石（renal colic）
C. 膽囊炎（cholecystitis）
D. 闌尾炎（appendicitis）

正確答案：B. 腎結石（renal colic）